Clinical trial exclusion criterion:
Current participation in a clinical trial or in any study that may add significant burden or affect study outcomes

Annotated entities:
- Post-eligibility: "Current participation in a clinical trial or in any study that may add significant burden or affect study outcomes"